腕隧道症候群（Carpal tunnel syndrome）之發生率，何者為正確？
A. 女性多於男性
B. 男性多於女性
C. 男女比率差不多
D. 不同研究報告結果不同

正確答案：A. 女性多於男性